以下那一種方法可以提高一個人的自我效能？
A. 給予社會制裁
B. 給予展現成功之自我挑戰經
C. 給予後果嚴重度性之威脅
D. 給予社會規範及依從動機

正確答案：B. 給予展現成功之自我挑戰經